Pregnant women admitted to Women health hospital with a diagnosis of severe pre-eclampsia

The above is a clinical trial inclusion criterion. Annotated with entity spans:
[Condition: Pregnant] [Person: women] [Procedure: admitted to] [Visit: Women health hospital] with a diagnosis of [Qualifier: severe] [Condition: pre-eclampsia]